Clinical trial exclusion criterion:
Known prolonged QTc (or evidence of such at screening) on electrocardiogram defined as >470 ms

Annotated entities:
- Measurement: "QTc"
- Procedure: "electrocardiogram"
- Value: ">470 ms"